黃太太今年 41 歲，育有一位 15 歲男孩，並無重要病史及家族史，亦未定期作健康檢查。她來到你的門診接受預防醫學服務，除了量血壓、一般生化檢查、尿液檢查及子宮頸抹片外，根據美國預防服務工作小組（U.S. Preventive Service Task Force）的建議，應該再安排那些預防保健服務？
A. 目前不需要再安排其他檢查
B. 安排 BRCA 基因篩檢及乳房超音波
C. 教育如何每個月做乳房自我檢查
D. 安排乳房 X 光攝影（mammography）

正確答案：D. 安排乳房 X 光攝影（mammography）